Cuando un paciente presenta fractura de cadera y la enfermera le coloca una almohada abductora entre las piernas, está tratando de evitar:
1. Las úlceras por presión.
2. La trombosis profunda.
3. La luxación de la cadera.
4. La movilidad del miembro afecto.

Respuesta correcta: 3. La luxación de la cadera.